Clinical trial inclusion criterion:
major elective gastrointestinal, gynecological, prostate or bladder surgery patients who are = 60 years old.

Entity relations:
- Has_qualifier("gastrointestinal surgery", "elective")
- Has_value("old", "= 60 years old")
- OR("gastrointestinal surgery", "prostate surgery", "bladder surgery", "gynecological surgery")